Prior septal surgery

The above is a clinical trial exclusion criterion. Annotated with entity spans:
[Temporal: Prior] [Procedure: septal surgery]